有關腦膜炎奈瑟氏菌（Neisseria meningitidis）之敘述，下列何者錯誤？
A. 製作疫苗的成分是莢膜多醣體（capsular polysaccharides）
B. 常由帶菌的動物得到感染
C. 主要經由呼吸道感染
D. 可能引起嚴重	血症，造成腎上腺（adrenal gland）的損壞

正確答案：B. 常由帶菌的動物得到感染